Clinical trial exclusion criterion:
Chronic liver disease with aminotransferase levels two times or more above the local upper limit of normal range

Annotated entities:
- Condition: "Chronic liver disease"
- Measurement: "aminotransferase"
- Value: "two times or more above the local upper limit of normal range"